Allergy to tranexamic acid, floseal, rivaroxaban, or the excipients

The above is a clinical trial exclusion criterion. Annotated with entity spans:
[Condition: Allergy] to [Drug: tranexamic acid], [Drug: floseal], [Drug: rivaroxaban], or the [Drug: excipients]